Clinical trial inclusion criterion:
confirmed diagnosis of H. pylori infection by at least one of the following methods: 13C-urea breath test, histology, rapid urease test or bacterial culture

Entity relations:
- AND("13C-urea breath test", "H. pylori infection")
- OR("13C-urea breath test", "histology", "rapid urease test", "bacterial culture")